肺	狀上皮細胞癌之特徵與下列那一項最不相關？
A. 抽菸
B. 常發生於支氣管
C. 常發生於肺門
D. 常產生神經內分泌物質

正確答案：D. 常產生神經內分泌物質